Clinical trial inclusion criterion:
immediate sub-pectoral prosthetic reconstruction;

Entity relations:
- Has_qualifier("sub-pectoral prosthetic reconstruction", "immediate")